Participation in another clinical trial at present or within 4 weeks of study entry. There may be exceptions at the discretion of the Investigator.

The above is a clinical trial exclusion criterion. Annotated with entity spans:
[Value: Participation] in another clinical trial at present or within 4 weeks of study entry. There may be exceptions at the discretion of the Investigator.